Clinical trial inclusion criterion:
Non-pregnant (post-menopausal, surgically sterile or using effective contraceptive measures)

Entity relations:
- Has_negation("pregnant", "Non")
- multi("surgically sterile", "surgically")
- Has_qualifier("contraceptive measures", "effective")
- Subsumes("pregnant", "post-menopausal")
- OR("post-menopausal", "contraceptive measures", "surgically sterile")